Clinical trial inclusion criterion:
RLS symptoms for at least 4 of 7 consecutive evenings/nights during the screening period.

Entity relations:
- Has_multiplier("RLS symptoms", "at least 4 of 7 consecutive evenings/nights")